Clinical trial exclusion criterion:
Hemoglobin < 9 g/dL.

Annotated entities:
- Measurement: "Hemoglobin"
- Value: "< 9 g/dL"